Inability to consent/refusal Allergy to any of the study medications Multiple traumatic injuries Contraindication to neuraxial or general anesthesia Pregnancy

The above is a clinical trial exclusion criterion. Annotated with entity spans:
[Line: Inability to consent/refusal] [Line: Allergy to any of the study medications] [Line: Multiple traumatic injuries] [Line: Contraindication to neuraxial or general anesthesia] [Line: Pregnancy]